下列敘述，何者正確？
A. 抗生素可以預防尿路感染（urinary tract infection）
B. 抗生素可以預防中央靜脈導管（central venous catheter）相關的血流感染
C. 手術前避免在遠離手術部位之處發生感染，可以防止發生手術部位感染（surgical site infections）
D. 營養不良的病人若在營養風險篩檢時營養不良分數（nutritional risk screening maluntrition score）得到5分，在手術前不需要矯正

正確答案：C. 手術前避免在遠離手術部位之處發生感染，可以防止發生手術部位感染（surgical site infections）